下列那一種神經系統的疾病，最不適合用血漿交換術（plasma exchange）來治療？
A. 危急性重症肌無力（myasthenia crisis）
B. 慢性發炎性脫髓鞘多發性神經炎（chronic inflammatory demyelinating polyneuropathy）
C. 多發神經（根）炎（Guillain-Barré syndrome）
D. 邊緣系統腦炎（limbic encephalitis）

正確答案：D. 邊緣系統腦炎（limbic encephalitis）